Clinical trial exclusion criterion:
Daily use of of antioxidants >300mg

Entity relations:
- Has_multiplier("antioxidants", ">300mg")
- Has_multiplier("antioxidants", "Daily use")